History of diabetic ketoacidosis, pancreas or beta-cell transplantation, or diabetes secondary to pancreatitis or pancreatectomy; acute or chronic infective diseases, cancer or chemotherapy, history of pulmonary, renal or liver diseases, and drug abuse

The above is a clinical trial exclusion criterion. Annotated with entity spans:
[Temporal: History] of [Condition: diabetic ketoacidosis], [Procedure: pancreas] or [Procedure: beta-cell transplantation], or [Condition: diabetes] [Qualifier: secondary to] [Procedure: pancreatitis] or [Procedure: pancreatectomy]; [Qualifier: acute] or [Qualifier: chronic] [Condition: infective diseases], [Condition: cancer] or [Procedure: chemotherapy], history of [Condition: pulmonary], [Condition: renal] or [Condition: liver diseases], and [Condition: drug abuse]